下列何者為目前臺灣法律不容許的醫療行為？
A. 捐贈卵子
B. 捐贈精子
C. 代理孕母
D. 冷凍胚胎

正確答案：C. 代理孕母